Clinical trial exclusion criterion:
7. Pulmonary hypertension due to:

Annotated entities:
- Parsing_Error: "7."
- Parsing_Error: "Pulmonary hypertension due to:"